Clinical trial inclusion criterion:
Patient has demonstrated compliance, as assessed by the investigator, with the parent study requirements

Annotated entities:
- Non-query-able: "Patient has demonstrated compliance, as assessed by the investigator, with the parent study requirements"